有關以立體定位手術治療巴金森氏症之敘述，下列何者錯誤？
A. 目標以視丘下核為主
B. 以深部腦刺激為主
C. 可以同時做雙側手術
D. 對顫抖症狀最無療效

正確答案：D. 對顫抖症狀最無療效